Clinical trial inclusion criterion:
6. Understand and sign the informed consent form;

Annotated entities:
- Post-eligibility: "Understand and sign the informed consent form;"
- Non-query-able: "Understand and sign the informed consent form;"